下列有關眼球光學模型（schematic eye）之數據，何者最不可能？
A. 角膜前彎曲面的曲率半徑約為 43 毫米
B. 前房水和玻璃體液的折射係數（index of refraction）均各為 1.3337
C. 整個眼球的全屈折力（total refracting power）約有＋60 個屈光度（diopters）
D. 正視（emmetropic）眼球的前後徑軸長，平均約有 23 毫米

正確答案：A. 角膜前彎曲面的曲率半徑約為 43 毫米